Clinical trial inclusion criterion:
hospital admission for COPD exacerbation

Annotated entities:
- Visit: "admission"
- Condition: "COPD exacerbation"